Written student consent assent for those under the age of 18 (or if 18 years old and older consent for themselves)

The above is a clinical trial inclusion criterion. Annotated with entity spans:
[Informed_consent: Written student consent assent for those under the age of 18 (or if 18 years old and older consent for themselves)]